Clinical trial exclusion criterion:
LVEF < 40%

Entity relations:
- Has_value("LVEF", "< 40%")